李太太為一家庭主婦，一個月前參加旅行團至大陸雲南等地旅遊，回國後身體略感不適，近日更因高燒不退，倦怠及全身不適而求醫。實驗室檢查發現周邊血液有瘧原蟲，數目約 60000/µl，紅血球數為 250 萬/µl，則病人之寄生蟲血症大約是：
A. 小於 0.5%
B. 0.5%~1%
C. 1%~2%
D. 大於 2%

正確答案：D. 大於 2%